Clinical trial exclusion criterion:
asthma and COPD

Entity relations:
- OR("asthma", "COPD")